Which hormone abnormalities are common in Williams syndrome

Elevated Thyrotropin - TSH
Low FT4
Growth Hormone deficiency
Calcitonin deficiency
Elevated Prolactin
Elevated Cortisol
Elevated Oxytocin
Elevated Vasopressin